What type of genome, (RNA or DNA, double stranded single stranded) is found in the the virus that causes blue tongue disease?

Bluetongue virus (BTV) genome contains ten double-stranded RNA segments.